下列有關眼外肌（extraocular muscles）之敘述，何者錯誤？
A. 四條直肌（rectus muscles）的起始點（origins）均在眼窩尖（orbital apex）之Zinn氏環（annulus）
B. 四條直肌的終止點（insertions）均在眼球赤道部（equator）之前
C. 兩條斜肌（oblique muscles）的終止點均在眼球赤道部之後
D. 上斜肌（superior oblique muscle）使眼球看斜上、下斜肌（inferior oblique muscle）使眼球看斜下

正確答案：D. 上斜肌（superior oblique muscle）使眼球看斜上、下斜肌（inferior oblique muscle）使眼球看斜下